At least one top quality embryo

The above is a clinical trial inclusion criterion. Annotated with entity spans:
[Value: At least one] [Measurement: top quality embryo]